Clinical trial exclusion criterion:
Use of NAC prior to trial (< 1 month of planned surgery)

Entity relations:
- Has_index("prior to trial", "trial")
- Has_mood("surgery", "planned")
- Has_temporal("surgery", "< 1 month")
- Has_temporal("NAC", "prior to trial")
- Subsumes("prior to trial", "surgery")